What is the function of WAPL protein on cohesin?

Human Wapl is a cohesin-binding protein that promotes sister-chromatid resolution in mitotic prophase. We show that the human ortholog of Wapl is a cohesin-binding protein that facilitates cohesin's timely release from chromosome arms during prophase.